18歲女性，左頸部腫痛且皮膚變紅，伴隨發燒，則下列何診斷最常見？
A. 亞急性甲狀腺炎
B. 先天有梨狀竇瘻管（pyriform sinus fistula）
C. 先天有甲狀腺舌管囊腫（thyroglossal duct cyst）
D. 甲狀腺未分化癌

正確答案：B. 先天有梨狀竇瘻管（pyriform sinus fistula）